Patient with moderate or severe chronic atopic dermatitis

The above is a clinical trial inclusion criterion. Annotated with entity spans:
Patient with [Qualifier: moderate] or [Qualifier: severe] [Condition: chronic atopic dermatitis]